Clinical trial exclusion criterion:
Major surgery (e.g., requiring general anesthesia) <=30 days before first dose of study treatment. Subjects must have recovered from any surgery related toxicities.

Annotated entities:
- Procedure: "Major surgery"
- Procedure: "general anesthesia"
- Temporal: "<=30 days before first dose of study treatment"
- Reference_point: "first dose of study treatment"
- Non-query-able: "Subjects must have recovered from any surgery related toxicities."